"Weibel-Palade 體（Weibel-Palade body）＂主要位於下列何種細胞？
A. 動脈之內皮細胞
B. 動脈之平滑肌細胞
C. 靜脈之內皮細胞
D. 靜脈之平滑肌細胞

正確答案：A. 動脈之內皮細胞